有關小腸功能之敘述，下列何者錯誤？
A. 製造分泌somatostatin
B. 製造分泌histamine
C. 製造分泌cholecystokinin
D. 製造分泌secretin

正確答案：B. 製造分泌histamine